目前治療輕度至中度子宮內膜異位症的藥物，下列那一項錯誤？
A. Progestins
B. Dexamethasone
C. Danazol
D. Gonadotropin-releasing hormone（GnRH）agonist

正確答案：B. Dexamethasone